Which master regulator drives liver development?

Hepatocyte nuclear factor (HNF)4α regulates fetal liver development.